關於測量尺度（measurement scale）的敘述，下列何者正確？
A. 血型為序位尺度（ordinal scale）
B. 膽固醇值（mg／100 ml）為等比尺度（ratio scale）
C. 體溫（攝氏度C）為等比尺度（ratio scale）
D. 癌症分期為等距尺度（interval scale）

正確答案：B. 膽固醇值（mg／100 ml）為等比尺度（ratio scale）